Subject has active tuberculosis or has had tuberculosis in the past three (3) years.

The above is a clinical trial exclusion criterion. Annotated with entity spans:
Subject has active [Condition: tuberculosis] or has had [Condition: tuberculosis] [Temporal: in the past three (3) years].